Patients using any herbal psychoactive treatments, e.g. St John's Wort, Valerian, Kava Kava, L-tryptophan.

The above is a clinical trial exclusion criterion. Annotated with entity spans:
Patients using any [Procedure: herbal psychoactive treatments], e.g. [Drug: St John's Wort], [Drug: Valerian], [Drug: Kava Kava], [Drug: L-tryptophan].